下列那一種失語症其覆誦（repetition）能力最佳？
A. conduction aphasia
B. anomic aphasia
C. global aphasia
D. Wernicke aphasia

正確答案：B. anomic aphasia